1976 年夏天，美國退伍軍人在費城召開退伍軍人協會會議期間，在同一住宿的飯店竟然發現有 221 人罹患「急性肺炎」，並因而導致 34 名感染者死亡，下列何者後來被證實為致病原？
A. Legionella pneumophila
B. Chlamydia pneumoniae
C. Streptococcus pneumoniae
D. Haemophilus influenzae

正確答案：A. Legionella pneumophila